Clinical trial exclusion criterion:
If Diabetes is present

Annotated entities:
- Condition: "Diabetes"